Highly frail patients whose estimated lifespan due to comorbidities by the judgement of the investigator is less than 6 months.

The above is a clinical trial exclusion criterion. Annotated with entity spans:
Highly frail patients whose estimated [Observation: lifespan] due to comorbidities by the judgement of the investigator is [Temporal: less than 6 months].